Clinical trial exclusion criterion:
Has an active autoimmune disease that has required systemic treatment in the past 2 years. Replacement therapy is not considered a form of systemic treatment.

Entity relations:
- Has_temporal("autoimmune disease", "active")
- AND("autoimmune disease", "systemic treatment")
- Has_temporal("autoimmune disease", "in the past 2 years")